Clinical trial inclusion criterion:
4. All subjects should be judged normal and healthy during a pre-study medical evaluation (physical examination, laboratory evaluation, 12-lead ECG, hepatitis B and hepatitis C tests, HIV test, and urine drug screen including amphetamine, barbiturates, benzodiazepine, cannabinoid, cocaine, opiates, phencyclidine, and methadone) performed within 14 days of the initial dose of study medication.

Annotated entities:
- Condition: "normal"
- Condition: "healthy"
- Procedure: "pre-study medical evaluation"
- Procedure: "physical examination"
- Procedure: "laboratory evaluation"
- Procedure: "12-lead ECG"
- Procedure: "hepatitis B tests"
- Procedure: "hepatitis C tests"
- Procedure: "HIV test"
- Procedure: "urine drug screen"
- Qualifier: "amphetamine"
- Qualifier: "barbiturates"
- Qualifier: "benzodiazepine"
- Qualifier: "cannabinoid"
- Qualifier: "cocaine"
- Qualifier: "opiates"
- Qualifier: "phencyclidine"
- Qualifier: "methadone"
- Temporal: "within 14 days of the initial dose of study medication"
- Reference_point: "the initial dose of study medication"